Clinical trial exclusion criterion:
Acute or chronic clinically significant gastrointestinal disease

Annotated entities:
- Qualifier: "clinically significant"
- Condition: "gastrointestinal disease"
- Qualifier: "Acute"
- Qualifier: "chronic"